Provide informed consent to participate in the study and understand that they may withdraw their consent at any time without prejudice to their future medical care.

The above is a clinical trial inclusion criterion. Annotated with entity spans:
[Informed_consent: Provide informed consent to participate in the study and understand that they may withdraw their consent at any time without prejudice to their future medical care].